Clinical trial exclusion criterion:
Patient is currently enrolled in another clinical trial

Annotated entities:
- Observation: "enrolled in another clinical trial"
- Temporal: "currently"